Clinical trial inclusion criterion:
Age between 20 and 40 years

Entity relations:
- Has_value("Age", "between 20 and 40 years")